Clinical trial exclusion criterion:
Performed intraoperative ablation

Annotated entities:
- Procedure: "intraoperative ablation"